=18-40 year old women

The above is a clinical trial inclusion criterion. Annotated with entity spans:
=[Value: 18-40 year] [Person: old] [Person: women]